Clinical trial exclusion criterion:
Patients actively listed for transplantation at time of entry into the study or anticipated to undergo heart transplantation, interventional catheterization, or corrective cardiac surgery during the 7 months following entry into the study

Entity relations:
- multi("listed for transplantation", "transplantation")
- Has_index("at time of entry into the study", "entry into the study")
- Has_temporal("listed for transplantation", "at time of entry into the study")
- Has_index("during the 7 months following entry into the study", "entry into the study")
- Has_mood("heart transplantation", "anticipated to undergo")
- Has_temporal("heart transplantation", "during the 7 months following entry into the study")
- OR("heart transplantation", "interventional catheterization", "corrective cardiac surgery")
- OR("listed for transplantation", "heart transplantation")